關於慢性高血壓孕婦併發子癇前症（pre-eclampsia），下列敘述何者錯誤？
A. 在有慢性高血壓的孕婦中，大約有20%～30%的孕婦會發生子癇前症
B. 慢性高血壓孕婦併發子癇前症的週數，約有50%發生在37週之前
C. 有慢性高血壓的孕婦之前血壓能控制在130/85 mmHg左右，若近期血壓使用先前藥物仍然不能控制在140/90 mmHg以下
D. 若有慢性高血壓的孕婦在懷孕前沒有腎臟疾病，懷孕後肌酸酐（creatinine）若大於1.1 mg/dL則可診斷為子癇前症

正確答案：C. 有慢性高血壓的孕婦之前血壓能控制在130/85 mmHg左右，若近期血壓使用先前藥物仍然不能控制在140/90 mmHg以下